Clinical trial exclusion criterion:
Prior cardiac surgery

Entity relations:
- Has_temporal("cardiac surgery", "Prior")